¿Cuáles se consideran los componentes del procedimiento de inversión del hábito para el tratamiento de los tics?
1. El autorregistro de los tics y la relajación.
2. El autocontrol y el manejo de contingencias por parte de los padres.
3. La exposición con prevención de respuesta y reestructuración cognitiva.
4. El entrenamiento en aumentar la conciencia de ocurrencia de los tics y la práctica de una respuesta competitiva.
5. La relajación y la práctica de una respuesta competitiva.

Respuesta correcta: 4. El entrenamiento en aumentar la conciencia de ocurrencia de los tics y la práctica de una respuesta competitiva.